Clinical trial exclusion criterion:
Patients with known or suspected hypersensitivity to the used medication were also excluded from the study.

Annotated entities:
- Condition: "hypersensitivity"
- Mood: "suspected"
- Mood: "known"
- Drug: "used medication"